What is Taupathy?

Taupathy is a progressive neurodegenerative disease of the central nervous system caused by autosomal recessive mutations in the Tau (amyloid precursor protein 1) gene.